El éter cíclico de seis miembros con un átomo de oxígeno, se denomina:
1. Oxolano.
2. Oxano.
3. Dioxano.
4. Oxirano.
5. Oxetano.

Respuesta correcta: 2. Oxano.